What is the mode of inheritance in Fanconi anemia?

Fanconi anemia (FA) is a rare inherited syndrome. So far, fifteen genetic subtypes have been distinguished. The mode of inheritance for all subtypes is autosomal recessive, except for FANCB, which is X-linked.